下列那一種黏	分子（adhesion molecules）能存在於白血球上，使得白血球可以黏附於血管內皮（blood  vessel endothelium）上？
A. E-selectins
B. ICAMs
C. Integrins
D. Fibronectin

正確答案：C. Integrins